Clinical trial exclusion criterion:
Brain tumor and other neoplastic disorders outside the brain where disease itself or its treatment (radiation, chemotherapy) is likely to affect brain structure or function.

Entity relations:
- Has_qualifier("neoplastic disorders", "outside the brain")
- Subsumes("Brain tumor", "likely to affect brain function")
- OR("likely to affect brain structure", "likely to affect brain function")
- OR("Brain tumor", "neoplastic disorders", "radiation", "chemotherapy")